In which syndrome is the RPS19 gene most frequently mutated?

The RPS19 mutation group was associated with higher requirement for chronic treatment for anemia than other DBA groups.